Muchacha de 19 años, sin antecedentes médicos de interés, salvo un cuadro gripal autolimitado 3 semanas antes, que acude al servicio de Urgencias por petequias y equímosis de aparición espontánea. En la exploración física la paciente se encuentra con buen estado general, afebril, normotensa y orientada en tiempo y espacio. Se observan petequias diseminadas por EEII y abdomen y equimosis pequeñas en zonas de decúbito. No se palpan adenopatías ni esplenomegalia. La analítica realizada ofrece los siguientes hallazgos: Hb 12,6 g/dL, Leucocitos 5.500/mm3, plaquetas 7000/mm3. El estudio del frotis de sangre periférica ofrece una morfología eritrocitaria normal, recuento leucocitario diferencial normal y el recuento plaquetario es concordante con la cifra del autoanalizador sin observarse agregados plaquetares. Bioquímica, proteinograma, beta 2 microglobulina y LDH normal. ¿Cuál cree que es, de los siguientes, el tratamiento inicial más adecuado?
1. Transfusión de plaquetas.
2. Rituximab en pauta semanal.
3. Ciclofosfamida en pulsos de 4 días cada 21 días.
4. Plasmaféresis diaria.
5. Prednisona a 1 mg/día durante 2-3 semanas.

Respuesta correcta: 5. Prednisona a 1 mg/día durante 2-3 semanas.